¿En qué fase o fases del sueño se producen los terrores nocturnos?:
1. En las fases del sueño lento profundo (fases 3 y 4).
2. En la fase 2.
3. En el sueño REM.
4. En la fase 1.
5. Pueden producirse indistintamente en cualquier fase del sueño.

Respuesta correcta: 1. En las fases del sueño lento profundo (fases 3 y 4).